La sensibilidad de una prueba diagnóstica se relaciona con:
1. Su capacidad de discriminación de verdaderos positivos.
2. Su capacidad de discriminación de verdaderos negativos.
3. Su capacidad de discriminación de falsos positivos.
4. Su capacidad de discriminación de falsos negativos.
5. El elevado punto de corte.

Respuesta correcta: 1. Su capacidad de discriminación de verdaderos positivos.